Clinical trial inclusion criterion:
Severity of depression: A 24-Item Hamilton Depression Rating Scale (HDRS) = 20.

Entity relations:
- Has_value("24-Item Hamilton Depression Rating Scale", "= 20")
- Subsumes("24-Item Hamilton Depression Rating Scale", "HDRS")
- AND("depression", "24-Item Hamilton Depression Rating Scale")